下列何者不受閉孔神經（obturator nerve）的支配？
A. 內收短肌（adductor brevis）
B. 股薄肌（gracilis）
C. 閉孔內肌（obturator internus）
D. 內收長肌（adductor longus）

正確答案：C. 閉孔內肌（obturator internus）